Clinical trial inclusion criterion:
Documentation of HIV diagnosis in the medical record by a healthcare provider.

Annotated entities:
- Condition: "HIV diagnosis"